下列有關老人的麻醉敘述，何者錯誤？
A. 術前評估應綜合考量許多風險因子，若僅考慮年齡本身，不考慮其他風險預測因子，則年齡為一次要因子
B. 老人的麻醉藥蛋白結合度下降，故麻醉藥效力減少
C. 目前並無證據顯示在手術週期（perioperative），老人實施半身麻醉比全身麻醉發生的併發症較少
D. 術後認知功能障礙（postoperative cognitive dysfunction）發生率在老人較高

正確答案：B. 老人的麻醉藥蛋白結合度下降，故麻醉藥效力減少